體內苯丙胺酸羥化酶（phenylalanine hydroxylase）活性的缺失會導致苯丙酮酸尿症
A. 患者無法自行合成足夠的酪胺酸（tyrosine）
B. 患者尿液中會出現大量的色胺酸（tryptophan）
C. 患者會對苯丙胺酸（phenylalanine）過敏
D. 患者腸道無法吸收足夠的苯丙胺酸（phenylalanine）

正確答案：A. 患者無法自行合成足夠的酪胺酸（tyrosine）